Subjects completed PEAK can be included within 30 days after End Of the Study

The above is a clinical trial inclusion criterion. Annotated with entity spans:
[Post-eligibility: Subjects completed PEAK can be included within 30 days after End Of the Study]